下列對 DNA 複製之描述，何者正確？
A. DNA 複製無需耗能
B. DNA 複製是屬於全保留模式（conservative model）
C. DNA 複製需一段 RNA 引子
D. DNA 複製可從 DNA 任一點開始

正確答案：C. DNA 複製需一段 RNA 引子